Clinical trial exclusion criterion:
alcoholism and drug dependence.

Entity relations:
- OR("alcoholism", "drug dependence")